腹膜透析治療中最重要的併發症為那一種？
A. 高血糖（Hyperglycemia）
B. 感染（Infection）
C. 疝氣（Hernia）
D. 滲漏（leakage）

正確答案：B. 感染（Infection）